一位 65 歲男性病人發生急性食道靜脈曲張出血（variceal bleeding），下列何種治療不考慮？
A. 藥物 somatostatin or octreotide 治療
B. 內視鏡結紮術
C. 內視鏡硬化劑注射
D. 食道橫截切除術

正確答案：D. 食道橫截切除術